Clinical trial inclusion criterion:
history of significant bleeding (i.e. bleeding which required intervention or hospitalization), even in the absence of anticoagulation treatment at the time of the bleeding event, or

Annotated entities:
- Condition: "bleeding"
- Qualifier: "significant"
- Condition: "bleeding"
- Procedure: "intervention"
- Procedure: "hospitalization"